Clinical trial exclusion criterion:
Abnormal liver function (AST/ALT > x3 upper normal limit)

Entity relations:
- Has_value("AST/ALT", "> x3 upper normal limit")
- Has_value("liver function", "Abnormal")
- Subsumes("liver function", "AST/ALT")